El fenómeno genético que explica que la expresión de un gen esté influida por el sexo del progenitor es:
1. Característica limitada por el sexo.
2. Característica ligada al sexo.
3. Herencia citoplasmática.
4. Impronta genómica.
5. Efecto genético materno.

Respuesta correcta: 4. Impronta genómica.